Clinical trial exclusion criteria:
Diabetic patients
Patients with any macular changes prior to the surgery (epiretinal membranes, age macular disease, macular edema...)
Patients who had any complication during phacoemulsification surgery

Annotated entities:
- Condition: "Diabetic"
- Condition: "macular changes"
- Qualifier: "any"
- Temporal: "prior to the surgery"
- Reference_point: "the surgery"
- Procedure: "surgery"
- Condition: "epiretinal membranes"
- Condition: "age macular disease"
- Condition: "macular edema"
- Qualifier: "any"
- Condition: "complication"
- Procedure: "phacoemulsification surgery"
- Temporal: "during phacoemulsification surgery"
- Reference_point: "phacoemulsification surgery"